What is the radiation-induced CD8 lymphocyte apoptosis (RILA) assay used for?

Radiation-induced lymphocyte apoptosis (RILA) has been suggested as a predictive assay for adverse late reactions after radiotherapy.